Es un heteropolisacárido:
1. Hialuronano.
2. Celulosa.
3. Quitina.
4. Dextrano.
5. Glucógeno.

Respuesta correcta: 1. Hialuronano.